Clinical trial exclusion criterion:
Lesion larger than 4 cm in the longest dimension

Annotated entities:
- Condition: "Lesion"
- Value: "larger than 4 cm"
- Measurement: "longest dimension"